Clinical trial exclusion criterion:
Non-compliant with blood-letting

Entity relations:
- AND("Non-compliant", "blood-letting")